Neuropathy, grade 2 or greater by NCI-CTCAE, v 4.0

The above is a clinical trial exclusion criterion. Annotated with entity spans:
[Condition: Neuropathy], [Value: grade 2 or greater] by [Measurement: NCI-CTCAE, v 4.0]